Las propiedades antiagregantes plaquetarias de la eptifibátida derivan de:
1. El bloqueo de los receptores de ADP que produce.
2. La inhibición enzimática que ejerce sobre la PDE.
3. La inhibición selectiva que produce sobre el factor Xa.
4. Sus propiedades antagonistas sobre el complejo GP IIb/IIIa.

Respuesta correcta: 4. Sus propiedades antagonistas sobre el complejo GP IIb/IIIa.